Clinical trial exclusion criterion:
For subjects enrolled at Indian sites: Moderate or severe acute illness/infection (according to investigator judgment) on the day of vaccination or febrile illness (temperature ≥ 38.0°C).

Annotated entities:
- Visit: "Indian sites"
- Qualifier: "Moderate"
- Qualifier: "severe"
- Condition: "acute illness"
- Condition: "acute infection"
- Subjective_judgement: "according to investigator judgment"
- Temporal: "on the day of vaccination"
- Reference_point: "the day of vaccination"
- Condition: "febrile illness"
- Measurement: "temperature"
- Value: "≥ 38.0°C"